Clinical trial exclusion criterion:
Symptomatic, unstable or uncontrolled, cardiac arrhythmias. Patients who have stable, rate-controlled atrial fibrillation are eligible for study enrollment.

Annotated entities:
- Condition: "cardiac arrhythmias"
- Qualifier: "uncontrolled"
- Qualifier: "unstable"
- Qualifier: "Symptomatic"
- Condition: "atrial fibrillation"
- Grammar_Error: "are eligible"
- Negation: "are eligible"
- Qualifier: "rate-controlled"
- Qualifier: "stable"